朱先生近年來因業務關係而經常前往中國大陸、泰國及越	等地區，其本人嗜食生魚片及魚生粥，日前因腹部不適及出現黃疸病症（jaundice）而就醫，經醫院檢查發現有膽管阻塞，並經手術取出數條蟲體。依據上述結果，朱先生最不可能感染何種寄生蟲？
A. 中華肝吸蟲（Clonorchis sinensis）
B. 貓肝吸蟲（Opisthorchis felineus）
C. 泰國肝吸蟲（Opisthorchis viverrini）
D. 槍狀肝吸蟲（Dicrocoelium dendriticum）

正確答案：D. 槍狀肝吸蟲（Dicrocoelium dendriticum）